下列何種降血脂藥物主要作用機轉在於抑制小腸細胞對膽固醇之吸收，進而減低血中膽固醇含量？
A. Cholestyramine
B. Ezetimibe
C. Simvastatin
D. Niacin

正確答案：B. Ezetimibe